Which is the molecular target of the immunosuppressant drug Rapamycin?

The molecular target of Rapamycin is mTOR